Clinical trial exclusion criterion:
Eczema, history of eczema, exfoliative skin conditions, wounds, burns, or other skin conditions at the investigator's discretion.

Entity relations:
- OR("Eczema", "history of eczema", "exfoliative skin conditions", "wounds", "burns", "other skin conditions")